Clinical trial exclusion criterion:
Inclusion in another study in the last 2 months.

Annotated entities:
- Context_Error: "Inclusion in another study"
- Non-query-able: "Inclusion in another study"
- Post-eligibility: "Inclusion in another study"
- Temporal: "in the last 2 months"
- Procedure: "Inclusion in another study"